Las ARN polimerasas se caracterizan por:
1. Comenzar la síntesis de ARN sin necesidad de cebadores.
2. Sintetizar ARN en dirección 3’−> 5’.
3. Una tasa de error menor que las ADN polimerasas.
4. Incorporar ribonucleótidos sin necesidad de un molde.
5. Incorporar T en lugar de U.

Respuesta correcta: 1. Comenzar la síntesis de ARN sin necesidad de cebadores.